下列有關水痘及帶狀疹的治療之敘述，何者錯誤？
A. 幼兒水痘可投予 aspirin 以減緩不適感
B. 免疫不全病人的水痘一定要用 acyclovir 治療
C. 免疫不全病人的帶狀疹一定要用 acyclovir 治療
D. 帶狀疹引起的神經痛，在併用抗病毒藥物的情形下可考慮用類固醇來緩解

正確答案：A. 幼兒水痘可投予 aspirin 以減緩不適感